Pregnancy.

The above is a clinical trial exclusion criterion. Annotated with entity spans:
[Condition: Pregnancy].